Clinical trial inclusion criterion:
LVAD on warfarin requiring temporary interruption of anticoagulation for procedures

Annotated entities:
- Condition: "LVAD"
- Drug: "warfarin"
- Non-representable: "requiring temporary interruption of anticoagulation for procedures"
- Qualifier: "requiring temporary interruption of anticoagulation for procedures"